Clinical trial exclusion criterion:
Untreated inflow disease of the ipsilateral pelvic arteries (more than 50%stenosis or or occlusion

Entity relations:
- Has_qualifier("inflow disease", "Untreated")
- Has_qualifier("inflow disease", "ipsilateral pelvic arteries")
- Has_value("stenosis", "more than 50%")
- AND("inflow disease", "stenosis")
- OR("more than 50%", "occlusion")